細菌性脊椎骨髓炎最常見致病菌種為：
A. Staphylococcus aureus
B. Salmonella enteritidis
C. Escherichia coli
D. Viridans group Streptococcus

正確答案：A. Staphylococcus aureus